Clinical trial exclusion criteria:
Ongoing acute kidney injury Stage 2/3
History of kidney transplant

Annotated entities:
- Condition: "acute kidney injury"
- Measurement: "Stage"
- Value: "2/3"
- Procedure: "kidney transplant"
- Temporal: "History"